Has received sorafenib or oxaliplatin-based chemotherapy within 14 days of first dose of study medication

The above is a clinical trial exclusion criterion. Annotated with entity spans:
Has received [Qualifier: sorafenib or oxaliplatin-based] [Procedure: chemotherapy] [Temporal: within 14 days] of [Reference_point: first dose of study medication]